在 HNPCC（hereditary nonpolyposis colorectal cancer）患者中，最常見的腸道外腫瘤為何？
A. 膀胱癌
B. 胃癌
C. 子宮內膜癌
D. 卵巢癌

正確答案：C. 子宮內膜癌